La encopresis retentiva se caracteriza por:
1. Ausencia de estreñimiento.
2. Ser significativamente más frecuente que la encopresis no retentiva.
3. Acomodación rectal disminuida.
4. Estar asociada a alteraciones en la percepción de la distención rectal.
5. Disminución en la capacidad contráctil del esfínter anal externo.

Respuesta correcta: 2. Ser significativamente más frecuente que la encopresis no retentiva.